下列那一種全身性麻醉劑會抑制呼吸中樞及降低對二氧化碳的敏感性？
A. Thiopental
B. Halothane
C. Ketamine
D. Nitrous oxide

正確答案：A. Thiopental